Clinical trial exclusion criterion:
Pregnant or nursing (lactating) women

Annotated entities:
- Condition: "Pregnant"
- Observation: "nursing"
- Observation: "lactating"
- Person: "women"